下列有關肺葉氣腫（lobar emphysema）之敘述，何者為誤？
A. 通常發生在出生後 6 個月內
B. 大約 4 分之 1 病人有支氣管軟骨發育不全（bronchial cartilage dysplasia）
C. 病人常見有細支氣管炎（bronchiolitis）
D. 與氣喘病（asthma）關係密切，須投予類固醇藥物

正確答案：D. 與氣喘病（asthma）關係密切，須投予類固醇藥物